下列有關結腸扭結（colonic volvulus）的敘述，何者錯誤？
A. 乙狀結腸是最常發生的部位
B. 盲腸（cecum）扭結危險因子包括食物纖維的大量攝取、精神藥物的服用及腹部手術的既往史
C. 盲腸（cecum）扭結應先嘗試大腸鏡還原再施行常規手術
D. 盲腸（cecum）扭結常合併部份或全部升結腸的扭轉

正確答案：C. 盲腸（cecum）扭結應先嘗試大腸鏡還原再施行常規手術